在進行子宮切除（hysterectomy）結紮子宮動脈時，下列何者最可能會被誤紮？
A. 卵巢動脈（ovarian artery）
B. 陰部內動脈（internal pudendal artery）
C. 輸尿管（ureter）
D. 陰部神經（pudendal nerve）

正確答案：C. 輸尿管（ureter）